Clinical trial inclusion criterion:
scheduled for elective cesarean section.

Annotated entities:
- Procedure: "cesarean section"
- Qualifier: "elective"
- Mood: "scheduled for"